Cuando el entrenamiento en autoinstrucciones se realiza en niños pequeños, ¿cuál de las siguientes indicaciones puede NO ayudar al éxito del entrenamiento?
1. Comenzar el entrenamiento con actividades de juego.
2. Trabajar con dos niños.
3. Utilizar técnicas de imaginación.
4. Potenciar que el niño memorice y utilice mecánicamente las autoinstrucciones.
5. Combinar con técnicas de reforzamiento.

Respuesta correcta: 4. Potenciar que el niño memorice y utilice mecánicamente las autoinstrucciones.